一位52歲男性因反覆發生下肢癱瘓入院，血壓168/98 mmHg，血液檢查發現：鈉146  mmol/L，鉀2.0 mmol/L，氯100 mmol/L，酸鹼值7.56，重碳酸根38 mmol/L，腎素（renin）
 1 ng/mL/hr（正常值0.3～3 ng/mL/hr），血清醛固酮（aldosterone）8 ng/dL（正常值2～9 ng/dL）；則下列敘述何者錯誤？
A. 病患為留鹽激素過多狀態（mineralocorticoid excess state）
B. 應補充大量鉀離子直到病患肌肉力量恢復
C. 因血清腎素偏低，可以排除腎素分泌腫瘤（renin-secreting tumor）及續發性高醛固酮症
D. 因血清醛固酮正常，可以排除原發性高醛固酮症

正確答案：D. 因血清醛固酮正常，可以排除原發性高醛固酮症